1999 年美國 Institute of Medicine 發表「To Err is Human」這份報告，激起了全世界對那一種醫療問題的重視？
A. 病人權利
B. 醫療費用飆漲
C. 病人安全
D. 醫療資源合理分配

正確答案：C. 病人安全